Clinical trial inclusion criterion:
Abbreviated MDRD eGFR = 30 mL/min/1.73m2.

Annotated entities:
- Measurement: "MDRD eGFR"
- Value: "= 30 mL/min/1.73m2"